Clinical trial inclusion criterion:
Female and male participants of reproductive potential must agree to use adequate contraception starting from the first dose of study medication, throughout the study period, and for up to 120 days after the last dose of study medication

Annotated entities:
- Procedure: "adequate contraception"
- Person: "male"
- Person: "Female"
- Grammar_Error: "and"
- Condition: "reproductive potential"
- Non-query-able: "Female and male participants of reproductive potential must agree to use adequate contraception starting from the first dose of study medication, throughout the study period, and for up to 120 days after the last dose of study medication"
- Post-eligibility: "Female and male participants of reproductive potential must agree to use adequate contraception starting from the first dose of study medication, throughout the study period, and for up to 120 days after the last dose of study medication"